Provision of voluntary written informed consent

The above is a clinical trial inclusion criterion. Annotated with entity spans:
[Post-eligibility: Provision of voluntary written informed consent]